Clinical trial exclusion criterion:
Currently receiving any other investigational drug or having received an investigational drug within the 60 days preceding the baseline visit (Visit 2).

Annotated entities:
- Competing_trial: "Currently receiving any other investigational drug or having received an investigational drug within the 60 days preceding the baseline visit (Visit 2)"